Clinical trial inclusion criterion:
Pregnant women between 34-42 weeks gestation

Annotated entities:
- Condition: "Pregnant"
- Person: "women"
- Value: "between 34-42 weeks"
- Measurement: "gestation"